7. Patient known to be Human Immunodeficiency Virus (HIV)-positive

The above is a clinical trial exclusion criterion. Annotated with entity spans:
[Parsing_Error: 7.] Patient known to be [Measurement: Human Immunodeficiency Virus (HIV)]-[Value: positive]